Clinical trial exclusion criteria:
Diagnosis as CD first time or first year.
No history of using 5-ASA, biological or immunomodulatory therapy

Annotated entities:
- Condition: "CD"
- Qualifier: "first time"
- Qualifier: "first year"
- Negation: "No"
- Temporal: "history"
- Drug: "5-ASA"
- Procedure: "therapy biological"
- Procedure: "immunomodulatory therapy"